Clinical trial inclusion criterion:
Consecutive 30 female patients presenting to our clinic for brow lifting with botulinum toxin will be randomized to receive one of the two injection techniques

Entity relations:
- AND("brow lifting", "botulinum toxin")
- Has_multiplier("female", "30")
- AND("female", "brow lifting")